the child is enrolled in an ongoing study of Bacillus Calmette Guerin vaccine and is < 2 months old

The above is a clinical trial exclusion criterion. Annotated with entity spans:
[Competing_trial: the child is enrolled in an ongoing study of Bacillus Calmette Guerin vaccine and is < 2 months old]